小葉中心性肺氣腫主要病變發生於何處？
A. 支氣管
B. 呼吸性細支氣管
C. 遠端肺泡
D. 所有肺泡

正確答案：B. 呼吸性細支氣管